Clinical trial inclusion criterion:
Stable coronary artery disease

Annotated entities:
- Condition: "coronary artery disease"
- Qualifier: "Stable"